Clinical trial exclusion criterion:
Giant papillary conjunctivitis (GCP) worse than grade 1

Entity relations:
- Has_qualifier("Giant papillary conjunctivitis (GCP)", "worse than grade 1")